Clinical trial inclusion criterion:
Adults = 18 years of age

Annotated entities:
- Person: "age"
- Value: "= 18 years"
- Person: "Adults"